Ante un paciente con enfermedad de Crohn que va a comenzar tratamiento con terapia biológica antiTNF (anticuerpos anti factor de necrosis tumoral alfa), ¿cuál de las siguientes pruebas diagnósticas no es necesaria antes de iniciar dicha terapia?
1. Valoración del estadio inmunitario mediante contaje linfocitario.
2. Serología del virus de hepatitis B (VHB).
3. Prueba de la tuberculina.
4. Radiografía de tórax.
5. Serología del virus de la inmunodeficiencia humana (VIH).

Respuesta correcta: 1. Valoración del estadio inmunitario mediante contaje linfocitario.